關於高血鉀（hyperkalemia）的處理，下列何者敘述錯誤？
A. 停止所有鉀離子的補充
B. 若血鉀濃度高於6.5 mEq/L，心電圖可能先出現peak T waves，進一步可能出現prolonged PR interval
C. 靜脈內注射胰島素改善高血鉀時，不可同時加葡萄糖點滴
D. 若高血鉀對於藥物的反應不佳，應考慮透析治療

正確答案：C. 靜脈內注射胰島素改善高血鉀時，不可同時加葡萄糖點滴